Clinical trial inclusion criterion:
Major subjects of over 40 years (mean age of Meniere's disease 40 to 50 years)

Annotated entities:
- Value: "over 40 years"
- Person: "years"